Clinical trial inclusion criterion:
Taking acetylsalicylic acid (ASA) 100 mg daily treatment for at least 7 days or taking ASA 100 mg daily dose for less than 7 days but with 300 mg ASA loading dose before PCI.

Annotated entities:
- Drug: "acetylsalicylic acid"
- Drug: "ASA"
- Multiplier: "100 mg"
- Multiplier: "daily"
- Temporal: "for at least 7 days"
- Drug: "ASA"
- Multiplier: "100 mg"
- Multiplier: "daily"
- Temporal: "for less than 7 days"
- Drug: "ASA"
- Multiplier: "300 mg"
- Temporal: "before PCI"
- Reference_point: "PCI"
- Procedure: "PCI"